Patients with resorbable upper face fillers injection in the past 12 months

The above is a clinical trial exclusion criterion. Annotated with entity spans:
Patients with [Procedure: resorbable] [Qualifier: upper face] fillers injection [Temporal: in the past 12 months]